Preoperative chronic opiate use for chronic pain defined as opiate usage at least 60 mg/day of morphine equivalent for = 3 months (as defined by International Association for the Study of Pain22) in the one year period prior to the bariatric surgery

The above is a clinical trial exclusion criterion. Annotated with entity spans:
[Temporal: Preoperative] [Multiplier: chronic] [Drug: opiate] use for [Condition: chronic pain] defined as [Drug: opiate] usage [Multiplier: at least 60 mg/day of morphine equivalent] [Multiplier: for = 3 months] (as defined by International Association for the Study of Pain22) [Temporal: in the one year period prior to the bariatric surgery]